病媒蚊可傳播許多感染症，有些甚至是致命的，請問下列何種感染症不是經由病媒蚊所傳播？
A. 黃熱病（yellow fever）
B. 回歸熱（relapsing fever）
C. 登革熱（dengue fever）
D. 日本腦炎（Japanese encephalitis）

正確答案：B. 回歸熱（relapsing fever）